5. History of major head trauma;

The above is a clinical trial exclusion criterion. Annotated with entity spans:
[Parsing_Error: 5.] [Temporal: History] of [Condition: major head trauma];